Clinical trial inclusion criteria:
Diagnosed epileptic patients of either sex with age between 10-19 yrs (<19yrs), coming to the medicine Out Patient /In Patient Departments and undergoing AED therapy for more than 6 months.
Epileptics with high homocysteine levels i.e. > 10.9 µmol/L (Normal homocysteine levels are 4.3-9.9 µmol/L for male and 3.3-7.2 µmol/L for female adolescent and a high homocysteine concentration is deaned as at least 11.4 µmol/L for male and at least 10.4 µmol/L for female. Gender mean of high homocysteine concentration is 10.9 µmol/L) [5]

Annotated entities:
- Condition: "epileptic"
- Person: "age"
- Value: "between 10-19 yrs"
- Value: "<19yrs"
- Visit: "Out Patient Departments"
- Visit: "In Patient Departments"
- Procedure: "AED therapy"
- Temporal: "for more than 6 months"
- Measurement: "homocysteine levels"
- Value: "high"
- Value: "> 10.9 µmol/L"
- Not_a_criteria: "(Normal homocysteine levels are 4.3-9.9 µmol/L for male and 3.3-7.2 µmol/L for female adolescent and a high homocysteine concentration is deaned as at least 11.4 µmol/L for male and at least 10.4 µmol/L for female. Gender mean of high homocysteine concentration is 10.9 µmol/L)"
- Parsing_Error: "[5]"